What is GenomeVIP?

Genome Variant Investigation Platform (GenomeVIP) is an open-source framework for performing genomics variant discovery and annotation using cloud- or local high-performance computing infrastructure.